眼壓（intraocular pressure）之高低與下列何者關聯性最低？
A. 房水（aqueous humour）之分泌速率（secretion）
B. 房水（aqueous humour）之排放速率（outflow）
C. 外鞏膜靜脈壓（episcleral venous pressure）
D. 腦脊髓液壓（cerebrospinal fluid pressure）

正確答案：D. 腦脊髓液壓（cerebrospinal fluid pressure）